Clinical trial exclusion criterion:
mRS=2;

Entity relations:
- Has_value("mRS", "=2")